流行性感冒（influenza）病人絕大多數在 2~5 天自行痊癒，然而有少數人可能發生併發症。下列有關 流行性感冒併發症的敘述，何者錯誤？
A. 肺炎是最常見的併發症，包含原發性流行性感冒病毒肺炎、細菌性肺炎及二者的混合型
B. 大人感冒且服用 acetaminophan 可能併發雷氏症候群（Reye's syndrome）
C. 幼兒罹患流行性感冒且服用 aspirin 可能併發雷氏症候群
D. 心肌炎、橫紋肌溶解、腦炎及 Guillain-Barre syndrome，都是流行性感冒可能出現的併發症

正確答案：B. 大人感冒且服用 acetaminophan 可能併發雷氏症候群（Reye's syndrome）